Clinical trial inclusion criterion:
Voluntary consent to take part in this trial

Annotated entities:
- Informed_consent: "Voluntary consent to take part in this trial"